Clinical trial exclusion criterion:
acute coronary syndrome

Annotated entities:
- Condition: "acute coronary syndrome"